Clinical trial inclusion criterion:
Prior radiation therapy, chemotherapy, or surgery in patients requiring flap reconstruction in the head and neck region.

Annotated entities:
- Procedure: "radiation therapy"
- Procedure: "chemotherapy"
- Procedure: "surgery"
- Procedure: "flap reconstruction"
- Condition: "requiring flap reconstruction"
- Qualifier: "head and neck region"
- Temporal: "Prior"